The pregnant or lactating woman

The above is a clinical trial exclusion criterion. Annotated with entity spans:
[Pregnancy_considerations: The pregnant or lactating woman]